Clinical trial inclusion criterion:
planned sequential both-sided lower third molar extraction (split-mouth) with osteotomy (with or without upper molar extraction in local anesthesia)

Entity relations:
- Has_qualifier("lower third molar extraction", "both-sided")
- Has_qualifier("lower third molar extraction", "sequential")
- Has_qualifier("lower third molar extraction", "split-mouth")
- AND("lower third molar extraction", "osteotomy")
- AND("upper molar extraction", "local anesthesia")
- AND("lower third molar extraction", "upper molar extraction")
- Has_mood("lower third molar extraction", "planned")